下列有關煤工塵肺症（coal worker pneumoconiosis）的敘述，何者錯誤？
A. 簡單型煤工塵肺症可見煤斑塊（coal macule）及煤結節（coal nodule）的病理變化
B. 複雜型煤工塵肺症可見密集之膠原和色素沉積
C. 煤工塵肺症患者較一般人易感染結核病
D. 煤工塵肺症患者若無吸菸則發生癌症的機率與一般人相近

正確答案：C. 煤工塵肺症患者較一般人易感染結核病